Clinical trial exclusion criterion:
Polytrauma; undergoing other surgeries or having other orthopedic injuries related to the precipitating cause of the ankle fracture

Annotated entities:
- Condition: "Polytrauma"
- Procedure: "other surgeries"
- Condition: "other orthopedic injuries"
- Condition: "ankle fracture"